Clinical trial exclusion criterion:
use of illicit drugs

Annotated entities:
- Drug: "illicit drugs"